Persons with impaired immune responsiveness (of any cause), including diabetes mellitus and autoimmune disorders

The above is a clinical trial exclusion criterion. Annotated with entity spans:
Persons with [Condition: impaired immune responsiveness] (of any cause), including [Condition: diabetes mellitus] and [Condition: autoimmune disorders]